El estilo terapéutico más recomendable para el tratamiento cognitivo del Trastorno Obsesivo Compulsivo incluye, entre otras, las características siguientes:
1. La aplicación correcta de las técnicas de exposición con prevención de respuesta.
2. Un empirismo colaborador y el uso del descubrimiento guiado.
3. Utilizar a los familiares para convencer al paciente de que sus obsesiones no tienen sentido y que sus rituales le hacen perder tiempo.
4. Un estilo directivo a la vez que tranquilizador, que promueva en el paciente la búsqueda de las causas de sus problemas en experiencias vitales tempranas negativas.

Respuesta correcta: 2. Un empirismo colaborador y el uso del descubrimiento guiado.